History of chronic diarrhea (lasting for more than 2 weeks in the past 6 months)

The above is a clinical trial exclusion criterion. Annotated with entity spans:
[Temporal: History] of [Condition: chronic diarrhea] ([Multiplier: lasting for more than 2 weeks] [Temporal: in the past 6 months])